Clinical trial exclusion criterion:
Liver disease such as cirrhosis or chronic active hepatitis.

Entity relations:
- Subsumes("Liver disease", "cirrhosis")
- OR("cirrhosis", "chronic active hepatitis")